Clinical trial exclusion criterion:
Chronic treatment with strong CYP3A4 inhibitor/ inducer, acid reducing agent, Proton pump inhibitors

Annotated entities:
- Drug: "strong CYP3A4 inhibitor"
- Drug: "strong CYP3A4 inducer"
- Drug: "acid reducing agent"
- Drug: "Proton pump inhibitors"